Clinical trial exclusion criterion:
Serious chronic disease including any medically significant chronic pulmonary, cardiovascular, renal, neurological, psychiatric or metabolic disorder, as determined by medical history and physical examination.

Entity relations:
- Has_qualifier("chronic disease", "Serious")
- Subsumes("chronic disease", "chronic cardiovascular disorder")
- OR("chronic cardiovascular disorder", "chronic renal disorder", "chronic neurological disorder", "chronic psychiatric disorder", "chronic metabolic disorder", "chronic pulmonary disorder")